Clinical trial inclusion criterion:
Renal function within normal range for age

Entity relations:
- Has_value("Renal function", "within normal range for age")